Patient able to receive neuraxial analgesia

The above is a clinical trial inclusion criterion. Annotated with entity spans:
Patient [Mood: able to receive] [Procedure: neuraxial analgesia]